下列何種病媒滋生感染症較易藉由輸血途徑而造成人傳人感染？
A. 巴西利什曼原蟲病（leishmaniasis braziliensis）
B. 萊姆病（Lyme disease）
C. 恙蟲病（scrub typhus）
D. 巴貝氏原蟲症（babesiosis）

正確答案：D. 巴貝氏原蟲症（babesiosis）